Clinical trial inclusion criterion:
Patients are on no other anti-diabetic drug treatment, or on stable maximum 3000 mg daily dose metformin treatment and/or on stable dose of a DPPIV inhibitor treatment for at least the last 3 months5. HbA1c levels =6.0% (=42 mmol/mol) and =9.0% (75 mmol/mol).

Annotated entities:
- Procedure: "anti-diabetic drug treatment"
- Negation: "no"
- Qualifier: "other"
- Qualifier: "stable"
- Multiplier: "maximum 3000 mg daily dose"
- Drug: "metformin"
- Qualifier: "stable dose"
- Drug: "DPPIV inhibitor"
- Temporal: "for at least the last 3 months"
- Measurement: "HbA1c levels"
- Value: "=6.0%"
- Value: "=42 mmol/mol"
- Value: "=9.0%"
- Value: "75 mmol/mol"